Clinical trial exclusion criterion:
Undergone surgery within 3 days prior to the first day of dosing.

Entity relations:
- Has_index("within 3 days prior to the first day of dosing", "first day of dosing")
- Has_temporal("surgery", "within 3 days prior to the first day of dosing")